If female and of childbearing potential, are willing to use adequate contraception (hormonal, barrier method, abstinence) prior to study entry and for the duration of study participation.

The above is a clinical trial inclusion criterion. Annotated with entity spans:
If [Person: female] and of [Condition: childbearing potential], are [Observation: willing to] use adequate [Procedure: contraception] ([Drug: hormonal], [Procedure: barrier method], [Procedure: abstinence]) [Temporal: prior to study entry] and [Temporal: for the duration of study participation].